Clinical trial exclusion criterion:
Any tobacco or nicotine product use in the past year

Annotated entities:
- Observation: "nicotine product use"
- Observation: "tobacco"
- Temporal: "past year"